Clinical trial exclusion criterion:
Allergy to local anaesthesia

Annotated entities:
- Condition: "Allergy"
- Drug: "local anaesthesia"